1. Taking a tetracycline within 6 months or history of adverse reaction to minocycline or another tetracycline.

The above is a clinical trial exclusion criterion. Annotated with entity spans:
1. Taking a [Drug: tetracycline] [Temporal: within 6 months] or [Temporal: history] of [Condition: adverse reaction] to [Drug: minocycline] or another [Drug: tetracycline].